Clinical trial exclusion criterion:
History of heparin-induced thrombocytopenia (HIT)

Annotated entities:
- Condition: "heparin-induced thrombocytopenia (HIT)"
- Temporal: "History"